El proceso de la esporulación bacteriana ocurre:
1. Tanto en bacterias Gram positivas como Gram negativas.
2. Tras el agotamiento de ciertos nutrientes esenciales.
3. Cuando aparecen factores ambientales desfavorables como la luz UV o el calor.
4. Durante el crecimiento exponencial.
5. Por gemación de una célula madre.

Respuesta correcta: 2. Tras el agotamiento de ciertos nutrientes esenciales.